關於自殺的敘述，何者正確？
A. 男女性自殺企圖（suicide attempt）與自殺死亡（completed suicide）率皆差不多
B. 自殺企圖男性比女性多，自殺死亡女性比男性多
C. 自殺企圖男性比女性多，自殺死亡也是男性多
D. 自殺企圖女性比男性多，自殺死亡男性比女性多

正確答案：D. 自殺企圖女性比男性多，自殺死亡男性比女性多